Clinical trial inclusion criterion:
Type 1 or 2 diabetes

Annotated entities:
- Condition: "Type 1 diabetes"
- Condition: "Type 2 diabetes"